Clinical trial inclusion criteria:
patients who underwent successful TAVI
with any approved TAVI device
via transfemoral access
with use of any of the approved vascular closure devices
provided written informed consent

Annotated entities:
- Procedure: "TAVI"
- Qualifier: "successful"
- Device: "TAVI device"
- Procedure: "transfemoral access"
- Device: "vascular closure devices"
- Informed_consent: "provided written informed consent"